Clinical trial inclusion criterion:
Resting heart rate =80 bpm

Annotated entities:
- Measurement: "Resting heart rate"
- Value: "=80 bpm"